下列那一個患者的腎絲球病變，與其他三者比較，其血清補體通常是不會下降的？
A. 47 歲男性，患有 C 型肝炎十年，近半年開始出現下肢水腫，尿液分析有 300 mg/dL 蛋白，高倍鏡
B. 55 歲男性拔牙後引起心內膜炎（infectious endocarditis）。尿液分析有 300 mg/dL 蛋白，高倍鏡檢
C. 25 歲女性，兩年前開始，上呼吸道感染兩天後就會出現肉眼可見血尿。尿液檢查有 100 mg/dL 蛋白，高倍鏡檢有 15-20 RBC
D. 34 歲女性，一年前開始有多發性關節炎，臉頰並有紅疹，抗核抗體為陽性。三個月開始出現水腫，尿液分析有 500 mg/dL 蛋白，高倍鏡檢有 20-30 RBC, 10-15 WBC

正確答案：C. 25 歲女性，兩年前開始，上呼吸道感染兩天後就會出現肉眼可見血尿。尿液檢查有 100 mg/dL 蛋白，高倍鏡檢有 15-20 RBC